Unstable cardiovascular disease with hospitalization within 1 year for acute coronary syndrome

The above is a clinical trial exclusion criterion. Annotated with entity spans:
Unstable cardiovascular disease with [Visit: hospitalization] [Temporal: within 1 year] for [Condition: acute coronary syndrome]